Use of drugs known to increase the risk for cardiac valvulopathy within 6 months before Screening, including but not limited to pergolide, ergotamine, methysergide, and cabergoline

The above is a clinical trial exclusion criterion. Annotated with entity spans:
Use of [Drug: drugs] [Qualifier: known to increase the risk for cardiac valvulopathy] [Temporal: within 6 months before Screening], including but not limited to [Drug: pergolide], [Drug: ergotamine], [Drug: methysergide], and [Drug: cabergoline]